Clinical trial exclusion criterion:
BMI <18.5

Annotated entities:
- Measurement: "BMI"
- Value: "<18.5"